La coenzima A:
1. Es un elemento lipofílico de la cadena de transporte electrónico o cadena respiratoria.
2. Participa en reacciones de transferencia de grupos acilo.
3. Contiene en su estructura tiamina o vitamina B1.
4. En su forma fosforilada activa la degradación del glucógeno.

Respuesta correcta: 2. Participa en reacciones de transferencia de grupos acilo.